Clinical trial inclusion criterion:
No more than 72 hours has elapsed since the first positive blood culture collection.

Entity relations:
- Has_value("blood culture collection", "positive")
- multi("the first positive blood culture collection", "blood culture collection")
- Has_index("No more than 72 hours since the first positive blood culture collection", "the first positive blood culture collection")